下列有關腹腔血液循環之敘述，何者錯誤？
A. 腸繫膜上動脈穿行於小腸繫膜內
B. 直腸上動脈（Superior rectal artery）是腸繫膜下動脈的終末分支
C. 肝門靜脈與體靜脈間沒有吻合枝
D. 肝、脾的動脈供應來自腹腔動脈幹（celiac trunk）

正確答案：C. 肝門靜脈與體靜脈間沒有吻合枝